Clinical trial exclusion criterion:
Signs of hemodynamic instability (i.e. systolic blood pressure <100 mm Hg.St. or episode of systolic blood pressure fall for =40 mm Hg. / or heart rate > 110 lasting more than 15 min) or need for ventilatory support within 12 hours prior to randomisation.

Entity relations:
- Has_value("systolic blood pressure", "<100 mm Hg.St.")
- Has_value("systolic blood pressure fall", "=40 mm Hg")
- Has_value("heart rate", "> 110")
- Has_multiplier("heart rate", "lasting more than 15 min")
- Has_mood("ventilatory support", "need for")
- Has_temporal("ventilatory support", "within 12 hours prior to randomisation")
- Subsumes("hemodynamic instability", "systolic blood pressure")
- OR("systolic blood pressure", "systolic blood pressure fall", "heart rate")
- OR("hemodynamic instability", "ventilatory support")